Clinical trial exclusion criterion:
Severe hepatic impairment.

Annotated entities:
- Qualifier: "Severe"
- Condition: "hepatic impairment"